Clinical trial exclusion criterion:
Subject with any current condition believed to have an increased risk of capsule retention such as suspected or known bowel obstruction, stricture, or fistula.

Annotated entities:
- Undefined_semantics: "condition believed to have an increased risk of capsule retention"